La dificultad para hallar palabras que designen objetos o personas (sustantivos y nombres), se denomina:
1. Anomia.
2. Glosomanía.
3. Aprosodia.
4. Bradifemia.
5. Parafemia.

Respuesta correcta: 1. Anomia.